El color de los ojos depende del pigmento presente en:
1. Pupila.
2. Córnea.
3. Iris.
4. Coroides.
5. Retina.

Respuesta correcta: 3. Iris.